Claustrophobia

The above is a clinical trial exclusion criterion. Annotated with entity spans:
[Condition: Claustrophobia]